下列那一項檢查與生長激素缺乏症（growth hormone deficiency）的診斷無關？
A. 血清第1型似胰島素生長因子（insulin-like growth factor-1, IGF-I）濃度
B. 血清第3型似胰島素生長因子結合蛋白（insulin-like growth factor binding protein 3, IGF-BP3）濃度
C. 升糖素刺激試	（glucagon stimulation test）
D. 葡萄糖耐受性試	（glucose tolerance test）

正確答案：D. 葡萄糖耐受性試	（glucose tolerance test）